Clinical trial inclusion criterion:
Patient is aged greater than or equal to 40 and less than or equal to 89 years of age

Entity relations:
- Has_value("aged", "greater than or equal to 40")
- Has_value("aged", "less than or equal to 89 years")